¿En qué unidades se suele expresar el coeficiente de absortividad molar?
1. mL mol-1 cm.
2. L mol-1 cm-3.
3. Fotones por mol.
4. M-1 cm-1.
5. Es adimensional.

Respuesta correcta: 4. M-1 cm-1.